Patients who had received non-surgical periodontal treatment within the past 6 months

The above is a clinical trial exclusion criterion. Annotated with entity spans:
Patients who had received [Procedure: non-surgical periodontal treatment] [Temporal: within the past 6 months]